Clinical trial exclusion criterion:
Allergy in dexmedethomidine and opioid

Annotated entities:
- Condition: "Allergy"
- Drug: "dexmedethomidine"
- Drug: "opioid"